67 歲男性，從兩年前開始在右臉上出現大片凹陷性的斑塊（depressed plaque），且其中合併許多小塊的深色區域。皮膚切片檢查顯示硬斑型基底細胞癌（morpheaform basal cell carcinoma）。最適當的治療方式是：
A. 雷射手術
B. 冷凍治療（cryosurgery）
C. 電燒手術（electrosurgery）
D. 莫氏手術（Mohs micrographic surgery）

正確答案：D. 莫氏手術（Mohs micrographic surgery）